關於第四期肺癌的治療，下列何者錯誤？
A. 第四期非小細胞肺癌有表皮生長因子受體（epidermal growth factor receptor）突變的治療是erlotinib、afatinib 等標靶治療
B. 第四期非小細胞肺癌有ALK基因重置（rearrangement）的治療是標靶治療，例如：crizotinib
C. 免疫檢查站（checkpoint）抑制劑對第四期非小細胞肺癌的治療毫無幫助
D. 第四期小細胞肺癌的治療主要是化學治療

正確答案：C. 免疫檢查站（checkpoint）抑制劑對第四期非小細胞肺癌的治療毫無幫助